下列有關人類的神經傳導速度檢查（nerve conduction study）之敘述，何者錯誤？
A. 常用於分辨肌肉病變與神經病變
B. 神經傳導速度在出生的嬰兒只有成人的一半
C. 常用於分辨急性與慢性神經病變
D. 神經傳導速度與體溫成正相關

正確答案：C. 常用於分辨急性與慢性神經病變